Clinical trial inclusion criterion:
Subject are able to complete study procedures, such as spirometry, and Pulmonary Exercise test.

Annotated entities:
- Procedure: "Pulmonary Exercise test"
- Procedure: "spirometry"
- Procedure: "study procedures"
- Undefined_semantics: "study procedures"